下列何者不是造成動脈粥狀硬化的主要危險因子？
A. 高血壓
B. 喝酒
C. 抽菸
D. 血漿高密度脂蛋白膽固醇（HDL cholesterol）過低（小於40 mg/dL）

正確答案：B. 喝酒